一位罹患僵直性脊椎炎的患者，有一天突覺左眼腫脹、怕光及視力模糊。下列何者為首選治療藥物？
A. methotrexate
B. hydroxychloroquine
C. local glucocorticoid administration
D. azathioprine

正確答案：C. local glucocorticoid administration